Clinical trial exclusion criterion:
With 3-4 grad Allergy to any drug in the treatment

Entity relations:
- Has_qualifier("drug", "any")
- AND("Allergy", "drug")
- Has_qualifier("Allergy", "3-4 grad")